Los desoxirribonucleótidos se sintetizan:
1. A partir de los ribonucleótidos trifosfato.
2. A partir de los ribonucleótidos difosfato.
3. A partir de NADPH.
4. Por oxidación de ribonucleótidos.
5. Por la DNA polimerasa III.

Respuesta correcta: 2. A partir de los ribonucleótidos difosfato.